If repeat irradiation would exceed any normal tissue constraint set by MSKCC Radiation Oncology Department dose constraint criteria, the patient will potentially be eligible.

The above is a clinical trial inclusion criterion. Annotated with entity spans:
If [Procedure: repeat irradiation] would [Value: exceed any normal tissue constraint] set by [Measurement: MSKCC Radiation Oncology Department dose constraint criteria], the patient will potentially be eligible.